Clinical trial inclusion criterion:
Sustained monomorphic VT documented on 12-lead ECG or rhythm strip terminated by pharmacologic means or DC cardioversion

Annotated entities:
- Condition: "monomorphic VT"
- Qualifier: "Sustained"
- Procedure: "12-lead ECG"
- Procedure: "rhythm strip"
- Procedure: "pharmacologic means"
- Procedure: "DC cardioversion"